Clinical trial exclusion criterion:
Clinically superinfected digital ulcers

Entity relations:
- Has_context("digital ulcers", "superinfected")